降膽固醇之 Statin 類藥物有時會造成肌肉傷害致血中肌肉酵素如 CK 上升。若同時服用下列何種藥物最可能增加 Statin 產生肌肉病變的比率或嚴重度？
A. Fibrate 類降血脂藥
B. 亨氏環利尿劑（loop diuretics）
C. Sulfonylurea 類降血糖藥
D. Warfarin 抗凝血藥

正確答案：A. Fibrate 類降血脂藥